Clinical trial exclusion criterion:
History of prostate, bladder, or rectal cancer

Annotated entities:
- Condition: "rectal cancer"
- Condition: "bladder cancer"
- Condition: "prostate cancer"